Serum bilirubin ≤1.5 x upper limit of normal (ULN).

The above is a clinical trial inclusion criterion. Annotated with entity spans:
[Measurement: Serum bilirubin] [Value: ≤1.5 x upper limit of normal (ULN)].